Clinical trial exclusion criterion:
BMI above 30.

Annotated entities:
- Measurement: "BMI"
- Value: "above 30"